d. Positive HIV, Hepatitis B, or Hepatitis C test. e. Renal disease or renal dysfunction (as suggested by serum creatinine levels greater than or equal to 1.5 mg/dL (for males) and greater than or equal to 1.4 mg/dL (for females) or abnormal creatinine clearance).

The above is a clinical trial exclusion criterion. Annotated with entity spans:
[Parsing_Error: d.] [Value: Positive] [Measurement: HIV], [Measurement: Hepatitis B], or [Measurement: Hepatitis C test]. [Parsing_Error: e.] [Condition: Renal disease] or [Condition: renal dysfunction] (as suggested by [Measurement: serum creatinine levels] [Value: greater than or equal to 1.5 mg/dL] (for [Person: males]) and [Value: greater than or equal to 1.4 mg/dL] (for [Person: females]) or [Condition: abnormal creatinine clearance]).